Clinical trial inclusion criterion:
Medically healthy

Annotated entities:
- Observation: "Medically healthy"